Clinical trial exclusion criterion:
Current treatment with tetracycline or derivative

Entity relations:
- Has_temporal("treatment", "Current")
- AND("treatment", "tetracycline")
- OR("tetracycline", "tetracycline derivative")